70歲男性病患腦中風合併腦壓上升，預行傳統開顱減壓手術，下列有關麻醉中降腦壓治療的敘述，何者錯誤？
A. 降動脈血中二氧化碳至30～33 mmHg
B. Mannitol（0.25～0.5 g/kg）降腦壓是因為改變血中滲透壓
C. 利尿劑（furosemide）有幫忙是因為減少腦組織水分及腦脊液產生
D. 動脈血中二氧化碳維持愈低愈好

正確答案：D. 動脈血中二氧化碳維持愈低愈好